¿Qué significa que “existe cooperatividad” cuando el oxígeno se une a la desoxihemoglobina?:
1. Que la entrada del primer oxígeno provoca cambios conformacionales en el tetrámero de hemoglobina y entonces los siguientes oxígenos entran con mayor dificultad.
2. Que la entrada del primer oxígeno provoca cambios conformacionales en el tetrámero de hemoglobina de modo que se facilita la entrada del segundo, éste la del tercero y así sucesivamente.
3. Que el CO2 facilita la entrada del oxígeno.
4. Que el oxígeno desplaza al CO2 de la hemoglobina.

Respuesta correcta: 2. Que la entrada del primer oxígeno provoca cambios conformacionales en el tetrámero de hemoglobina de modo que se facilita la entrada del segundo, éste la del tercero y así sucesivamente.